位於大腦鎌（falx cerebri）與小腦天幕（tentorium cerebelli）交接處的構造是：
A. 下矢狀竇（inferior sagittal sinus）
B. 直竇（straight sinus）
C. 匯竇（confluence of sinuses）
D. 枕竇（occipital sinus）

正確答案：B. 直竇（straight sinus）